Clinical trial exclusion criterion:
Documented untreated ventricular arrhythmia with syncopal episodes within the 3 months.

Annotated entities:
- Condition: "ventricular arrhythmia"
- Qualifier: "untreated"
- Condition: "syncopal episodes"
- Temporal: "within the 3 months"